Clinical trial inclusion criterion:
ASA Class I and II, eligible for endoscopic or surgical treatment with curative intent,

Annotated entities:
- Measurement: "ASA Class"
- Value: "I"
- Value: "II"
- Mood: "eligible for"
- Procedure: "treatment endoscopic"
- Procedure: "surgical treatment"
- Qualifier: "with curative intent"